王先生是一位具有 30 年抽菸史的 55 歲病患，日前因呼吸困難至門診檢查，胸部 X 光片顯示過度充氣的肺部、扁平的橫膈膜，疑似肺微血管減少和肺泡壁被破壞形成超大的肺泡囊，且呈現用力時呼吸困難的現象，肺功能檢查之 FEV1/FVC = 45%。下列何者可能會出現於此病患？
A. 限制性肺疾病（restrictive lung disease）
B. 肺順應性（lung compliance）減少
C. 生理性無效腔（physiological dead space）增加
D. 功能性肺餘容量（functional residual capacity）減少

正確答案：C. 生理性無效腔（physiological dead space）增加